Clinical trial exclusion criteria:
Subjects with cognitive, psychiatric, or other problems that preclude informed consent.
Patients with history of glucose intolerance or diabetes.
Patient on chemotherapy
People with any open or bleeding wounds at any sensor plate contact surface location
People with any type of implantable device
People with missing hand(s) and/or leg(s)
Pregnant women or women who are uncertain about a possible pregnancy
Patients sensitive to chemicals used to induce sweating
Patients with heat intolerance
Patients with bleeding disorders
Patients on current anticoagulant therapy
Patients with keloids on the intended biopsy site
People with hypersensitivity to local amide-type anesthetics

Annotated entities:
- Condition: "cognitive problems"
- Condition: "psychiatric problems"
- Condition: "other problems that preclude informed consent"
- Undefined_semantics: "Subjects with cognitive, psychiatric, or other problems that preclude informed consent"
- Subjective_judgement: "other problems that preclude informed consent"
- Condition: "glucose intolerance"
- Condition: "diabetes"
- Temporal: "history"
- Procedure: "chemotherapy"
- Condition: "bleeding wounds"
- Condition: "open wounds"
- Qualifier: "at any sensor plate contact surface location"
- Device: "implantable device"
- Condition: "missing hand"
- Condition: "missing leg"
- Condition: "Pregnant"
- Observation: "possible pregnancy"
- Non-query-able: "uncertain about a possible pregnancy"
- Condition: "sensitive to chemicals used to induce sweating"
- Undefined_semantics: "sensitive to chemicals used to induce sweating"
- Condition: "heat intolerance"
- Condition: "bleeding disorders"
- Procedure: "anticoagulant therapy"
- Temporal: "current"
- Condition: "keloids"
- Qualifier: "on the intended biopsy site"
- Condition: "hypersensitivity"
- Drug: "local amide-type anesthetics"